Participants able and willing to comply with all aspects of the study, including a standardized, reduced calorie diet and an age appropriate, increased physical activity program

The above is a clinical trial inclusion criterion. Annotated with entity spans:
Participants [Observation: able] and [Observation: willing to comply] with all aspects of the study, including a [Qualifier: standardized], [Observation: reduced calorie diet] and an [Qualifier: age appropriate], [Observation: increased physical activity program]